Clinical trial inclusion criterion:
abstinent from any tobacco/nicotine use for 4 hours prior to imaging

Entity relations:
- AND("abstinent", "tobacco")
- Has_index("for 4 hours prior to imaging", "imaging")
- Has_temporal("abstinent", "for 4 hours prior to imaging")
- OR("tobacco", "nicotine")